Patients must have adequate hepatic function as documented by a serum bilirubin less than or equal to 2x the institutional upper limit of normal, regardless of whether patients have liver involvement secondary to tumor. Patients may not have ascites or the ascites must be responsive to diuretics.

The above is a clinical trial inclusion criterion. Annotated with entity spans:
Patients must have [Value: adequate] [Measurement: hepatic function] as documented by a [Measurement: serum bilirubin] [Value: less than or equal to 2x the institutional upper limit of normal], regardless of whether patients have liver involvement secondary to tumor. Patients [Negation: may not have] [Condition: ascites] or the [Condition: ascites] must be [Qualifier: responsive to diuretics].